Clinical trial inclusion criterion:
IUD or Depo PLUS a barrier contraceptive

Annotated entities:
- Device: "IUD"
- Device: "Depo"
- Device: "barrier contraceptive"